Presence of active infection

The above is a clinical trial exclusion criterion. Annotated with entity spans:
Presence of [Condition: active infection]